HBA1c more than 108 mmol/l

The above is a clinical trial exclusion criterion. Annotated with entity spans:
[Measurement: HBA1c] [Value: more than 108 mmol/l]